Which disease is ZP-PTH used for?

ZP-PTH is used for the treatment of osteoporosis.